Anticipate not being available or able to comply with the schedule of study visits

The above is a clinical trial exclusion criterion. Annotated with entity spans:
[Post-eligibility: Anticipate not being available or able to comply with the schedule of study visits]